Which protein mediates gene loop formation in the yeast S. cerevisiae?

Gene looping, defined as the interaction of the promoter and the terminator regions of a gene during transcription, requires transcription factor IIB (TFIIB).